1. Subject is at least 18 years old.

The above is a clinical trial inclusion criterion. Annotated with entity spans:
1. Subject is [Value: at least 18 years] [Person: old].